Clinical trial exclusion criterion:
Major medical disorders (e.g., HIV, cancer)

Annotated entities:
- Condition: "medical disorders"
- Qualifier: "Major"
- Condition: "HIV"
- Condition: "cancer"